re-admission to ICU and has been enrolled during former admission to ICU

The above is a clinical trial exclusion criterion. Annotated with entity spans:
[Procedure: re-admission] to [Visit: ICU] and [Non-representable: has been enrolled during former admission to ICU]